History of receiving any antibiotics within prior 3 months,

The above is a clinical trial exclusion criterion. Annotated with entity spans:
[Temporal: History] of receiving any [Drug: antibiotics] [Temporal: within prior 3 months],